下列有關發炎性腸疾病（Inflammatory bowel disease）的外科治療適應症之敘述，何者錯誤？
A. 手術適應症包括下列合併症：腸阻塞、穿孔、管形成、出血、膿瘍形成等
B. 手術應作廣泛小腸切除，因其它跳躍病灶有造成上述合併症的可能
C. 小孩因此疾病引發生長遲緩
D. 有非腸道合併症

正確答案：B. 手術應作廣泛小腸切除，因其它跳躍病灶有造成上述合併症的可能